Clinical trial inclusion criterion:
mNeff 0 acute diverticulitis (abdominal computed tomography scan)

Annotated entities:
- Measurement: "mNeff"
- Value: "0"
- Condition: "diverticulitis"
- Qualifier: "acute"
- Procedure: "abdominal computed tomography scan"